Clinical trial exclusion criterion:
Significant head trauma.

Annotated entities:
- Qualifier: "Significant"
- Condition: "head trauma"